Clinical trial inclusion criterion:
After half-dose ticagrelor (loading dose 90mg, and then 45mg bidpo.) treatment for 3 days, the platelet aggregation is effectively inhibited by light transmission aggregometry method and thromboela-stogram.

Annotated entities:
- Multiplier: "half-dose"
- Drug: "ticagrelor"
- Measurement: "loading dose"
- Value: "90mg"
- Multiplier: "45mg bidpo."
- Temporal: "treatment for 3 days"
- Measurement: "platelet aggregation"
- Value: "inhibited"
- Qualifier: "effectively"
- Procedure: "light transmission aggregometry"
- Procedure: "thromboela-stogram"